一位67歲退休農夫近5年來逐漸感到運動時呼吸困難，經高解析度電腦斷層（HRCT）檢查，診斷出間質性肺纖維化（interstitial lung fibrosis）。下列敘述何者錯誤？
A. 自體免疫性或類肉瘤（sarcoidosis）所引起的病變機率較小
B. 肺功能的異常包括：FVC, FEV1降低，FEV1/FVC接近正常，而TLC降低
C. 運動肺功能的變化可作為預後的預測
D. 一氧化碳瀰散量（CO diffusing capacity, DLCO）通常會降低，但DLCO/VA（alveolar ventilation）是正常

正確答案：D. 一氧化碳瀰散量（CO diffusing capacity, DLCO）通常會降低，但DLCO/VA（alveolar ventilation）是正常